Clinical trial inclusion criterion:
Subject in a stable heterosexual relationship for at least 6 months. (2)

Entity relations:
- Has_qualifier("heterosexual relationship", "stable")
- Has_temporal("heterosexual relationship", "at least 6 months")